Myopia > 6D;

The above is a clinical trial exclusion criterion. Annotated with entity spans:
[Measurement: Myopia] [Value: > 6D];